腕隧道（Carpal tunnel）中，不包含下列何種構造？
A. 食指屈指淺肌（2nd flexor digitorum superficialis）
B. 橈側屈腕肌（flexor carpi radialis）
C. 正中神經（median nerve）
D. 小指屈指深肌（5th flexor digitorum profundus）

正確答案：B. 橈側屈腕肌（flexor carpi radialis）